Have chronic kidney disease with GFR <50

The above is a clinical trial inclusion criterion. Annotated with entity spans:
Have [Condition: chronic kidney disease] with [Measurement: GFR] [Value: <50]